Clinical trial exclusion criterion:
Persons referred to in Articles L1121-5 to L1121-8 of the French Public health Code: pregnant woman, parturient, nursing mother, person deprived of liberty by judicial or administrative decision, person subject to a legal protection measure, can not Be included in clinical trials.

Annotated entities:
- Context_Error: "Persons referred to in Articles L1121-5 to L1121-8 of the French Public health Code"
- Condition: "pregnant"
- Person: "woman"
- Condition: "parturient"
- Condition: "nursing"
- Observation: "deprived of liberty"